Clinical trial exclusion criterion:
hypersensitivity or contraindication to one of the study drugs

Annotated entities:
- Condition: "hypersensitivity"
- Condition: "contraindication"
- Multiplier: "one of"
- Drug: "study drugs"